Has given written informed consent.

The above is a clinical trial inclusion criterion. Annotated with entity spans:
[Informed_consent: Has given written informed consent.]